Clinical trial exclusion criterion:
bleeding dyscrasia

Annotated entities:
- Condition: "bleeding dyscrasia"